Clinical trial inclusion criterion:
Current DSM-IV diagnosis of cannabis dependence, >1 week detoxified and abstinent;

Annotated entities:
- Qualifier: "DSM-IV"
- Condition: "cannabis dependence"
- Multiplier: ">1 week"
- Condition: "detoxified"
- Condition: "abstinent"